History of TBI more severe than mild by DVBIC criteria

The above is a clinical trial exclusion criterion. Annotated with entity spans:
History of [Condition: TBI] [Value: more severe than mild] by [Measurement: DVBIC criteria]